From which tissue was the NCI-H520 cell-line derived?

Non-small cell lung cancer (NSCLC) cell line NCI-H520. 
Squamous cell carcinoma cell line NCI-H520.